Clinical trial inclusion criterion:
Women are post-menopausal (defined as at least 1 year post cessation of menses) and aged = 45 and = 70 years. Males are aged = 40 years and = 70 years. Patients should have suitable veins for cannulation or repeated venipuncture.

Annotated entities:
- Person: "Women"
- Condition: "post-menopausal"
- Temporal: "as at least 1 year post cessation of menses"
- Reference_point: "cessation of menses"
- Person: "aged"
- Value: "= 45 and = 70 years"
- Person: "Males"
- Person: "aged"
- Value: "= 40 years and = 70 years"
- Non-representable: "Patients should have suitable veins for cannulation or repeated venipuncture."